Life-time history of DSM 5 schizophrenia, bipolar disorder, or previous psychosis with or intolerance to cannabinoids

The above is a clinical trial exclusion criterion. Annotated with entity spans:
Life-time history of [Qualifier: DSM 5] [Condition: schizophrenia], [Condition: bipolar disorder], or previous [Condition: psychosis] with or [Condition: intolerance] to [Drug: cannabinoids]